支配下頜下腺（submandibular gland）之副交感神經纖維不經由：
A. 莖乳突孔（stylomastoid foramen）
B. 內耳道（internal acoustic meatus）
C. 中耳腔（middle ear cavity）
D. 舌神經（lingual nerve）

正確答案：A. 莖乳突孔（stylomastoid foramen）